Clinical trial inclusion criterion:
Patients must have been on a stable daily dose of weak opioids or strong opioids for at least 72 hours prior to the start the study and must remain at the same dosage for the duration of the study

Entity relations:
- Has_temporal("weak opioids", "at least 72 hours prior to the start the study")
- OR("weak opioids", "strong opioids")